Patients willing to sign his/her consent.

The above is a clinical trial inclusion criterion. Annotated with entity spans:
[Informed_consent: Patients willing to sign his/her consent].